Clinical trial inclusion criterion:
The ability to produce a visible precision grip force with one hand

Annotated entities:
- Procedure: "produce a visible precision grip force with one hand"
- Mood: "The ability to"